Clinical trial inclusion criteria:
1. Patient is over 18 years old.
2. Patient is scheduled for a non-emergency procedure.
3. Subject signs and dates a written informed consent form (ICF) and indicates an understanding of the study procedures.

Annotated entities:
- Value: "over 18 years old"
- Person: "years old"
- Procedure: "non-emergency procedure"
- Qualifier: "non-emergency"
- Mood: "scheduled"
- Post-eligibility: "3. Subject signs and dates a written informed consent form (ICF) and indicates an understanding of the study procedures."